一位 3 歲兒童腹瀉一星期，呼吸速率 35/分，並無呼吸窘迫現象，心跳 150/分，血壓 90/64 mmHg，微血管再填充時間為 5 秒，母親敘述一整天才小便一次，下列何者立即處置為佳？
A. 病童有體液缺損情形，應給予含葡萄糖電解質之低張溶液，但給予的速度不可太快以免心臟衰竭
B. 病童已有休克情形，單憑輸液無法改善血循，應合併給予 dopamine 2-5 μg/kg/min
C. 應給予 20 ml/kg 之生理食鹽水輸液，在半小時內全速靜脈輸注完畢
D. 口服輸液和靜脈輸液效果一樣好，給予口服電解質溶液 500 ml 在急診處觀察

正確答案：C. 應給予 20 ml/kg 之生理食鹽水輸液，在半小時內全速靜脈輸注完畢